Clinical trial inclusion criteria:
Probable or definite diagnosis of autoimmune hepatitis according to the International Autoimmune Hepatitis Study Group criteria
First presentation of AIH requiring treatment according to the current EASL guidelines
Age = 18 years
Must provide informed consent and agree to comply with the trial protocol

Annotated entities:
- Condition: "autoimmune hepatitis"
- Measurement: "International Autoimmune Hepatitis Study Group criteria"
- Measurement: "EASL guidelines"
- Procedure: "treatment"
- Condition: "AIH"
- Person: "Age"
- Value: "= 18 years"
- Informed_consent: "Must provide informed consent and agree to comply with the trial protocol"